Clinical trial exclusion criterion:
Unstable cardiac disease despite treatment, myocardial infarction within 6 months prior to study entry

Entity relations:
- Has_temporal("myocardial infarction", "within 6 months prior to study entry")
- OR("Unstable cardiac disease", "myocardial infarction")